What is the cause of Bow Hunter's syndrome?

Bow Hunter's Syndrome (BHS) is caused by the occlusion of the vertebral artery with head rotation leading to ischemia and sometimes stroke.